Patient with coronary artery disease

The above is a clinical trial inclusion criterion. Annotated with entity spans:
Patient with [Condition: coronary artery disease]